關於誤食有機磷（organophosphate）中毒，引起肌肉麻痺的原因，下列何者正確？
A. 有機磷占據骨骼肌終板上之 acetylcholine receptors
B. 運動神經無法產生動作電位
C. 運動神經無法釋放 acetylcholine
D. 運動神經釋放之 acetylcholine 無法被水解清除

正確答案：D. 運動神經釋放之 acetylcholine 無法被水解清除